What is the role of TAD protein domain?

TAD domain is a transcription activation domain found in transcription factors.